Clinical trial inclusion criterion:
only occlusal and/or occlusal-proximal surfaces with caries lesions with dentin involvement

Annotated entities:
- Condition: "caries lesions"
- Condition: "dentin involvement"
- Qualifier: "occlusal-proximal surfaces"
- Qualifier: "occlusal surfaces"